Clinical trial exclusion criteria:
Legally incompetent or mentally impaired (e.g., minors, Alzheimer's subjects, dementia, etc.)
Younger than 18 years of age
Any patient considered a vulnerable subject
Have bleeding or clotting disorder
Preoperative anticoagulation therapy
Abnormal coagulation profile
Renal disorder or insufficiency
Sickle cell disease

Annotated entities:
- Observation: "Legally incompetent"
- Condition: "mentally impaired"
- Person: "minors"
- Condition: "Alzheimer's"
- Condition: "dementia"
- Value: "Younger than 18 years"
- Person: "age"
- Observation: "vulnerable subject"
- Condition: "bleeding disorder"
- Condition: "clotting disorder"
- Temporal: "Preoperative"
- Procedure: "anticoagulation therapy"
- Drug: "anticoagulation"
- Value: "Abnormal"
- Measurement: "coagulation profile"
- Condition: "Abnormal coagulation profile"
- Condition: "Renal disorder"
- Condition: "Renal insufficiency"
- Condition: "Sickle cell disease"